Clinical trial inclusion criterion:
Participants with light chain and free light chain (FLC) only may be enrolled if they meet all the criteria for a diagnosis of MM.

Annotated entities:
- Measurement: "criteria for a diagnosis of MM"
- Value: "all"
- Condition: "light chain and free light chain (FLC)"